Clinical trial exclusion criterion:
Patients with renal impairment

Annotated entities:
- Condition: "renal impairment"